下列抗生素中何者之脂溶性最大，最容易通過血腦屏障（blood brain barrier）進入中樞神經以治療腦膜炎？
A. cefazolin
B. erythromycin
C. gentamicin
D. rifampin

正確答案：D. rifampin